關於柯沙科夫氏症候群（Korsakoff's syndrome），最少發生的症狀是下列那一項？
A. 近期記憶障礙（recent memory impairment）
B. 前行性失憶（anterograde amnesia）
C. 退行性失憶（retrograde amnesia）
D. 虛談（confabulation）

正確答案：C. 退行性失憶（retrograde amnesia）